Clinical trial exclusion criterion:
Known asthmatic or history of allergy towards peanut or milk products

Entity relations:
- causal("allergy", "peanut")
- Has_temporal("allergy", "history")
- OR("peanut", "milk products")
- OR("asthmatic", "allergy")